關於砂眼（trachoma）的敘述，下列何者錯誤？
A. 病原菌為披衣菌（Chlamydia）
B. 瘢痕性砂眼（cicatricial trachoma）可在上眼瞼結膜（superior palpebral conjunctiva）看見Arlt line
C. 結膜細胞的細胞核內有嗜伊紅性包涵體（eosinophilic inclusion bodies）
D. 藥物治療可以口服四環黴素和局部四環黴素合併治療為選項之一

正確答案：C. 結膜細胞的細胞核內有嗜伊紅性包涵體（eosinophilic inclusion bodies）